Clinical trial exclusion criterion:
History of thrombophilia or anticoagulant therapy

Entity relations:
- OR("thrombophilia", "anticoagulant therapy")